Clinical trial inclusion criterion:
Fasting glucose >140 mg/dl or random glucose >180 mg/dl

Annotated entities:
- Measurement: "Fasting glucose"
- Value: ">140 mg/dl"
- Measurement: "random glucose"
- Value: ">180 mg/dl"